Clinical trial inclusion criteria:
Idiopathic Parkinson's disease ( Hughes AJ et al. 2001)
Patients with motor fluctuations
Chronic Insomnia disorder criteria according to the criteria of DMS- V ( American Psychiatric Association, 2013) and insomnia severity index > 15
Able to use independently the device required for treatment by apomorphine
Collection of written informed consent (legal obligation for any project under the public health law , bioethics laws and / or CNIL) .
Affiliate to social security or beneficiary of such a regime

Annotated entities:
- Condition: "Parkinson's disease"
- Qualifier: "Idiopathic"
- Condition: "motor fluctuations"
- Condition: "Chronic Insomnia disorder"
- Qualifier: "criteria of DMS- V"
- Measurement: "insomnia severity index"
- Value: "> 15"
- Drug: "apomorphine"
- Device: "device"
- Non-query-able: "Collection of written informed consent (legal obligation for any project under the public health law , bioethics laws and / or CNIL) ."
- Person: "Affiliate to social security"
- Person: "social security beneficiary"